Clinical trial exclusion criterion:
Patients who received immunosuppressive medication in the last 6 weeks (e.g. cyclosporin, cyclophosphamide, azathioprine).

Annotated entities:
- Procedure: "immunosuppressive medication"
- Temporal: "in the last 6 weeks"
- Drug: "cyclosporin"
- Drug: "cyclophosphamide"
- Drug: "azathioprine"